有一農夫經常在稻穀收割期時發生急性發燒、咳嗽、呼吸困難，且血中白血球增高，其最可能的診斷為：
A. 支氣管肺炎
B. 結核性肺炎
C. 過敏性肺炎
D. 成人呼吸窘迫症候群

正確答案：C. 過敏性肺炎